Clinical trial exclusion criterion:
Albumin < 3g/dL at the time of enrollment

Annotated entities:
- Measurement: "Albumin"
- Value: "< 3g/dL"